Clinical trial inclusion criterion:
Able to swallow pills

Annotated entities:
- Post-eligibility: "Able to swallow pills"